Clinical trial inclusion criterion:
Subjects who, in the opinion of the investigator, can and will comply with the requirements of the protocol.

Annotated entities:
- Non-query-able: "in the opinion of the investigator"
- Observation: "comply with the requirements of the protocol"